自殺風險評估之因子中，那些屬於相對低風險？
A. 鰥寡
B. 衝動性之自殺行為
C. 自責（self blame）
D. 上吊或跳樓

正確答案：B. 衝動性之自殺行為